Clinical trial inclusion criterion:
Adults (18 and older) with physiologically confirmed SA or mild-moderate asthma and followed by an asthma specialist for at least 6 months.

Entity relations:
- Has_value("18 and older", "18 and older")
- multi("18 and older", "18 and older")
- Subsumes("Adults", "18 and older")
- Has_qualifier("asthma", "mild")
- Has_temporal("followed by an asthma specialist", "for at least 6 months")
- OR("mild", "moderate")